Clinical trial exclusion criterion:
Significant alcohol intake

Annotated entities:
- Observation: "alcohol intake"
- Qualifier: "Significant"